Is willing to comply with the visit schedule

The above is a clinical trial inclusion criterion. Annotated with entity spans:
[Non-query-able: Is willing to comply with the visit schedule]